Patients will be excluded if they have had exposure to a total daily dose of MET 1000 mg bid for at least 2 weeks in the past 3 months;

The above is a clinical trial exclusion criterion. Annotated with entity spans:
Patients will be excluded if they have had exposure to a total daily dose of [Drug: MET] [Multiplier: 1000 mg bid] for [Temporal: at least 2 weeks in the past 3 months];